Clinical trial exclusion criterion:
Treatment with glycoprotein IIb/IIIa inhibitors

Annotated entities:
- Drug: "glycoprotein IIb/IIIa inhibitors"